Endoscopically confirmed gastric and/or duodenal ulcers on Day 1.

The above is a clinical trial exclusion criterion. Annotated with entity spans:
[Qualifier: Endoscopically confirmed] [Condition: gastric] and/or [Condition: duodenal ulcers] [Temporal: on Day 1].